History or presence of any clinically significant disease or disorder

The above is a clinical trial exclusion criterion. Annotated with entity spans:
[Temporal: History] or presence of any [Undefined_semantics: clinically significant disease or disorder]